培養莢膜組織胞漿菌（Histoplasma capsulatum）時，為防止其他汙染真菌之干擾，通常於培養基中加入下列何者？
A. 環絲胺酸（Cycloserine）
B. 放線菌酮（Cycloheximide）
C. 氯法齊明（Clofazimine）
D. 奎奴普丁（Quinupristin）

正確答案：B. 放線菌酮（Cycloheximide）